Clinical trial inclusion criterion:
Has given written informed consent before any study-related activity is performed

Annotated entities:
- Informed_consent: "Has given written informed consent before any study-related activity is performed"